關於類澱粉沉積症（amyloidosis）的敘述，下列何者正確？
A. 阿茲海默症（Alzheimer disease）沉積的類澱粉，主要是屬AA（amyloid-associated）型澱粉樣蛋白
B. 甲狀腺髓質癌（medullary thyroid cancer）造成的類澱粉沉積主要因癌細胞產生的降鈣素（calcitonin）所致
C. 剛果紅（Congo red）染色只適合用來診斷輕鏈蛋白相關之類澱粉沉積症，無法偵測非原發性的類澱粉沉積
D. 交叉α折疊（crossed α-pleated）結構是剛果紅染色陽性的原因

正確答案：B. 甲狀腺髓質癌（medullary thyroid cancer）造成的類澱粉沉積主要因癌細胞產生的降鈣素（calcitonin）所致